Clinical trial exclusion criterion:
Pregnancy or breast feeding

Annotated entities:
- Pregnancy_considerations: "Pregnancy or breast feeding"